Respiratory exacerbation within the 2 months preceding the study

The above is a clinical trial exclusion criterion. Annotated with entity spans:
[Condition: Respiratory exacerbation] [Temporal: within the 2 months preceding the study]